有一懷疑感染廣東住血線蟲（Angiostrongylus cantonensis）的病患，目前那一種方法能做確認診斷？
A. 採腦脊髓液檢查是否有嗜伊紅性白血球
B. 觀察是否有腦膜炎的臨床症狀
C. 採腦脊髓液找蟲體並鑑別
D. 藉聚合酶鏈鎖反應檢查腦脊髓液是否有蟲體 DNA 片段

正確答案：C. 採腦脊髓液找蟲體並鑑別